Clinical trial inclusion criteria:
20-40 years old women
Spontaneously ovulating women
Treated in our IVF unit for frozen-thawed embryo transfer
At least one top quality embryo

Annotated entities:
- Value: "20-40 years"
- Person: "old"
- Person: "women"
- Condition: "Spontaneously ovulating"
- Person: "women"
- Visit: "our IVF unit"
- Procedure: "frozen-thawed embryo transfer"
- Value: "At least one"
- Measurement: "top quality embryo"